Clinical trial inclusion criterion:
Male or female, 18 years of age or older.

Entity relations:
- Has_value("age", "18 years or older")
- OR("Male", "female")